腦組織中出現 β 澱粉樣胜肽（β-amyloid）堆積，為阿滋海默氏病（Alzheimer's disease）的病理特徵之一。關於 β 澱粉樣胜肽的敘述，下列何者錯誤？
A. β 澱粉樣胜肽原先是某細胞膜蛋白的一部分
B. 核醣核酸編輯（RNA editing）為產生 β 澱粉樣胜肽的機制
C. β 澱粉樣胜肽的二級結構與正常狀態時並不相同
D. β 澱粉樣胜肽會在神經元外相互黏合形成沉澱物

正確答案：B. 核醣核酸編輯（RNA editing）為產生 β 澱粉樣胜肽的機制